足底長韌帶（long plantar ligament）前端附著於下列何骨？
A. 楔狀骨（cuneiform）
B. 距骨（talus）
C. 舟狀骨（navicular）
D. 骰骨（cuboid）

正確答案：D. 骰骨（cuboid）